En el tratamiento de la depresión, la terapia o entrenamiento en habilidades sociales se centra principalmente en mejorar clases o repertorios de conductas especialmente relevantes para los individuos deprimidos y entre los cuales está la aserción positiva. ¿A qué tipo de conductas se refiere la aserción positiva?
1. Conductas que permiten a la persona defender sus derechos e intereses.
2. Conductas de iniciar conversaciones, hacer preguntas y realizar autorrevelaciones apropiadas.
3. Conductas relativas a la expresión de afecto, aprobación y alabanza hacia otras personas.
4. Conductas para imponer los propios intereses por encima de los intereses de los demás.
5. Conductas para autogenerarse emociones positivas cuando una persona está sola.

Respuesta correcta: 3. Conductas relativas a la expresión de afecto, aprobación y alabanza hacia otras personas.